Clinical trial exclusion criterion:
colostomy, or do not perform regular bowel care for any reason

Entity relations:
- Has_negation("regular bowel care", "do not perform")
- OR("colostomy", "regular bowel care")